Clinically significant current Axis II (DSM-IV-TR) diagnosis

The above is a clinical trial exclusion criterion. Annotated with entity spans:
Clinically significant current [Qualifier: Axis II] ([Qualifier: DSM-IV-TR]) [Condition: diagnosis]